Clinical trial exclusion criterion:
Heart Team assessment of operability (the heart team considers the patient to be a good surgical candidate).

Annotated entities:
- Condition: "heart team considers the patient to be a good surgical candidate"
- Procedure: "Heart Team assessment of operability"